游離輻射之有效劑量（effective dose）的單位為何？
A. 格雷（Gray）
B. 雷得（Rad）
C. 西弗（Sievert）
D. 居里（Curie）

正確答案：C. 西弗（Sievert）